Known to be positive for hepatitis C or hepatitis B surface antigen

The above is a clinical trial exclusion criterion. Annotated with entity spans:
Known to be [Value: positive] for [Measurement: hepatitis C] or [Measurement: hepatitis B surface antigen]